Clinical trial exclusion criterion:
Presence of active or acute AIDS-defining opportunistic infections within 12 weeks prior to study entry.

Entity relations:
- Has_temporal("AIDS-defining opportunistic infections", "within 12 weeks prior to study entry")
- Has_temporal("AIDS-defining opportunistic infections", "active")
- OR("active", "acute")